Subjects were to give voluntary written informed consent to participate in the trial.

The above is a clinical trial inclusion criterion. Annotated with entity spans:
[Post-eligibility: Subjects were to give voluntary written informed consent to participate in the trial].